Clinical trial inclusion criterion:
Phase I: Patients must have histologically confirmed R/R NHL or HL (defined by WHO criteria). Patients with chronic lymphocytic leukemia (CLL) and small lymphocytic lymphoma (SLL) are eligible. In addition, patients with NHL other than diffuse large B cell lymphomas (DLBCL) must have received at least 2 prior therapies. Patients with DLBCL and HL will be eligible if there is no available standard therapy.

Annotated entities:
- Procedure: "histologically"
- Value: "confirmed"
- Condition: "NHL"
- Condition: "HL"
- Qualifier: "R/R"
- Measurement: "WHO criteria"
- Procedure: "chronic lymphocytic leukemia (CLL)"
- Procedure: "small lymphocytic lymphoma (SLL)"
- Grammar_Error: "and"
- Condition: "NHL"
- Condition: "diffuse large B cell lymphomas (DLBCL)"
- Multiplier: "at least 2"
- Negation: "other than"
- Procedure: "therapies"
- Temporal: "prior"
- Context_Error: "therapies"
- Condition: "DLBCL"
- Condition: "HL"
- Grammar_Error: "and"
- Procedure: "standard therapy"
- Undefined_semantics: "standard therapy"
- Negation: "no"
- Context_Error: "therapies"